Presence of haemodynamically significant mitral and/or aortic valve disease, except mitral regurgitation secondary to LV dilatation.

The above is a clinical trial exclusion criterion. Annotated with entity spans:
Presence of [Qualifier: haemodynamically significant] [Condition: mitral] and/or [Condition: aortic valve disease], [Negation: except] [Condition: mitral regurgitation] [Qualifier: secondary to LV dilatation].